Known history of significant inflammatory disease, other than COPD (e.g. rheumatoid arthritis and systemic lupus erythematosus).

The above is a clinical trial exclusion criterion. Annotated with entity spans:
Known history of [Qualifier: significant] [Condition: inflammatory disease], [Negation: other than] [Condition: COPD] (e.g. [Condition: rheumatoid arthritis] and [Condition: systemic lupus erythematosus]).